T1DM for at least 12 months

The above is a clinical trial inclusion criterion. Annotated with entity spans:
[Condition: T1DM] [Temporal: for at least 12 months]